A signed parental consent form.

The above is a clinical trial inclusion criterion. Annotated with entity spans:
[Informed_consent: A signed parental consent form].